Clinical trial exclusion criterion:
cardiovascular disease

Annotated entities:
- Condition: "cardiovascular disease"